Clinical trial exclusion criterion:
Contraindication for IAP measurement in supine position with head-of-bed at 0°

Entity relations:
- Has_qualifier("IAP measurement", "supine position")
- Has_qualifier("IAP measurement", "head-of-bed at 0°")
- AND("Contraindication", "IAP measurement")